內蹠神經（medial plantar nerve）受傷時，最不會影響下列何種動作？
A. 腳拇趾內收
B. 腳拇趾外展
C. 腳拇趾屈曲
D. 腳趾屈曲

正確答案：A. 腳拇趾內收